Depressed kidney function and/or AKI

The above is a clinical trial exclusion criterion. Annotated with entity spans:
[Condition: Depressed kidney function] and/or [Condition: AKI]